Clinical trial inclusion criterion:
Medically healthy on the basis of medical history and physical examination

Entity relations:
- Has_temporal("Medically healthy", "medical history")
- AND("Medically healthy", "physical examination")